Patients must be at least 21 years old.

The above is a clinical trial inclusion criterion. Annotated with entity spans:
Patients must be [Value: at least 21 years] [Person: old].